Un patógeno de rata que tiene a las pulgas como vectores de transmisión a humanos es:
1. Ricketssia rickettsii.
2. Yersinia pestis.
3. Borrelia burgdorferi.
4. Ehrlichia ewingii.
5. Brucella abortus.

Respuesta correcta: 2. Yersinia pestis.